Clinical trial inclusion criterion:
who require mechanical ventilation, and

Annotated entities:
- Procedure: "mechanical ventilation"